Clinical trial exclusion criterion:
Receiving antimicrobial therapy to treat non-tuberculous mycobacterium (e.g., M. abscessus, M. avium complex) in the two weeks prior to Visit 2

Annotated entities:
- Drug: "antimicrobial therapy"
- Qualifier: "non-tuberculous mycobacterium"
- Qualifier: "M. abscessus"
- Qualifier: "M. avium complex"
- Temporal: "in the two weeks prior to Visit 2"
- Reference_point: "Visit 2"